單純的哀傷反應（bereavement）通常不會有下列何種症狀？
A. 自殺想法
B. 注意力不集中
C. 做什麼事情都提不起興趣
D. 食慾不振

正確答案：A. 自殺想法